Clinical trial inclusion criterion:
Patient with evidence of endoscopic active proctitis or distal proctosigmoiditis (Montreal classification E1 or E2 defined by an involvement not exceeding 25 cm from the anal margin) within 6 months before study inclusion.

Annotated entities:
- Condition: "active proctitis"
- Condition: "distal proctosigmoiditis"
- Procedure: "endoscopic"
- Measurement: "Montreal classification"
- Value: "E1 or E2"
- Qualifier: "involvement not exceeding 25 cm from the anal margin"
- Temporal: "within 6 months before study inclusion"
- Reference_point: "study inclusion"